Volunteer chronically infected with HCV (as demonstrated by serology and/or viral load laboratory studies)

The above is a clinical trial inclusion criterion. Annotated with entity spans:
Volunteer [Qualifier: chronically] infected with [Condition: HCV] (as demonstrated by serology and/or viral load laboratory studies)